La fabricación de recuerdos para rellenar lagunas amnésicas puede constituir:
1. Un recuerdo deliroide.
2. Una fantasía amnésica.
3. Un falseamiento compulsivo.
4. Una confabulación.

Respuesta correcta: 4. Una confabulación.